Clinical trial exclusion criterion:
Known untreated B12 deficiency or malnutrition (body mass index [BMI] less than 18) at screening

Entity relations:
- Has_value("body mass index [BMI]", "less than 18")
- Subsumes("malnutrition", "body mass index [BMI]")
- Has_qualifier("B12 deficiency", "untreated")
- Has_temporal("B12 deficiency", "at screening")
- OR("B12 deficiency", "malnutrition")